下列何者同時會出現杵狀指（clubbing fingers）及發紺（cyanosis）現象？
A. 感染性心內膜炎（infective endocarditis）
B. 腸道發炎病（inflammatory bowel disease）
C. 正常人
D. 肺動靜脈管（pulmonary arteriovenous fistula）

正確答案：D. 肺動靜脈管（pulmonary arteriovenous fistula）